Clinical trial exclusion criterion:
Medical contraindications to SSRI therapy as determined by history (including induction of mania or hypomania during SSRI therapy, or known drug allergy)

Annotated entities:
- Condition: "contraindications to SSRI therapy"
- Condition: "mania"
- Temporal: "during SSRI therapy"
- Condition: "hypomania"
- Condition: "drug allergy"
- Temporal: "history"
- Procedure: "SSRI therapy"